Clinical trial inclusion criterion:
Women who are in their first 5 years of menopause

Entity relations:
- Has_index("n their first 5 years of menopause", "menopause")